下列何者不是多發性骨髓瘤診斷的必要條件？
A. Hypergammaglobulinemia
B. Clonal plasma cells in bone marrow
C. M-protein in serum or urine
D. Bone destruction

正確答案：A. Hypergammaglobulinemia